acute myocardial infarction or

The above is a clinical trial inclusion criterion. Annotated with entity spans:
[Condition: acute myocardial infarction] or